Clinical trial exclusion criterion:
Previous immunosuppressive or cytotoxic medication, in the last 6 months. Individuals who have made use of this kind of medication in non-immunosuppressant doses, as nasal corticosteroid for allergic rhinitis of topic corticosteroid for non-complicated dermatitis, for more than 14 days, are allowed to be included in the study.

Entity relations:
- Has_temporal("immunosuppressive medication", "in the last 6 months")
- OR("immunosuppressive medication", "cytotoxic medication")